Clinical trial exclusion criterion:
Symptomatic bradycardia or second- or third-degree atrioventricular block without a pacemaker.

Annotated entities:
- Condition: "bradycardia"
- Condition: "atrioventricular block"
- Qualifier: "third-degree"
- Qualifier: "second- degree"
- Negation: "without"
- Device: "pacemaker"